Type 1 diabetes according to ADA criterias <5 years.

The above is a clinical trial inclusion criterion. Annotated with entity spans:
[Condition: Type 1 diabetes] according to [Qualifier: ADA criterias] [Temporal: <5 years].